Clinical trial exclusion criterion:
8. A major surgical procedure, or significant traumatic injury ≤28 days of beginning treatment, or anticipation of the need for major surgery during the course of the study.

Annotated entities:
- Procedure: "surgical procedure"
- Qualifier: "major"
- Subjective_judgement: "major"
- Qualifier: "significant"
- Subjective_judgement: "significant"
- Condition: "traumatic injury"
- Temporal: "≤28 days of beginning treatment"
- Reference_point: "beginning treatment"
- Procedure: "major surgery"
- Mood: "need for"
- Temporal: "during the course of the study"
- Reference_point: "the course of the study"